Clinical trial exclusion criterion:
Previous treatment with cytotoxic agents or high-dose steroids

Annotated entities:
- Temporal: "Previous"
- Procedure: "treatment"
- Drug: "cytotoxic agents"
- Drug: "high-dose steroids"